動脈幹症（Truncus arteriosus）在出生後不久就有厲害的心臟衰竭，目前最佳的外科處理方式為：
A. 肺動脈環縮術
B. 在嬰兒期就作完全矯正術
C. 主動脈瓣修補術
D. 體動脈至肺動脈分流術

正確答案：B. 在嬰兒期就作完全矯正術